Clinical trial exclusion criterion:
Patients with paraspinal extension of disease with visceral involvement.

Annotated entities:
- Condition: "paraspinal extension of disease"
- Condition: "visceral involvement"